a history of more than two falls in the previous 12 months.

The above is a clinical trial exclusion criterion. Annotated with entity spans:
a [Temporal: history] of [Multiplier: more than two] [Condition: falls] [Temporal: in the previous 12 months].